Men: (0.006012 x H3) + (14.6 x W) + 604 = TBV

The above is a clinical trial inclusion criterion. Annotated with entity spans:
[Person: Men]: [Value: (0.006012 x H3) + (14.6 x W) + 604 =] [Measurement: TBV]